Clinical trial exclusion criterion:
2. Abnormal blood biochemistry defined as 3 times that of the upper limit of the normal range.

Annotated entities:
- Parsing_Error: "2."
- Measurement: "blood biochemistry"
- Value: "3 times that of the upper limit of the normal range"
- Value: "Abnormal"